Clinical trial exclusion criterion:
3. Intracranial EEG electrodes are being used

Annotated entities:
- Parsing_Error: "3."
- Device: "Intracranial EEG electrodes"